Clinical trial exclusion criterion:
Severe liver injury.

Annotated entities:
- Condition: "liver injury"
- Qualifier: "Severe"